What are the two types of duplicated genes in the yeast S. cerevisiae?

The mechanism of duplication matters, with whole-genome duplicates being more transcriptionally altered than small-scale duplicates.